STEMI

The above is a clinical trial exclusion criterion. Annotated with entity spans:
[Condition: STEMI]